La secreción de las glándulas sebáceas es:
1. Merocrina.
2. Apocrina.
3. Paracrina.
4. Holocrina.
5. Endocrina.

Respuesta correcta: 4. Holocrina.